Psychiatric antecedent

The above is a clinical trial exclusion criterion. Annotated with entity spans:
[Condition: Psychiatric] [Temporal: antecedent]